La sintomatología negativa de la esquizofrenia parece estar causada por:
1. La actividad excesiva de algunos circuitos neurales dopaminérgicos.
2. La actividad excesiva de las neuronas gabaérgicas.
3. La existencia de daños cerebrales.
4. Tener un gen de la esquizofrenia que provoque sintomatología negativa.
5. Insuficiente actividad de las neuronas serotoninérgicas del lóbulo frontal.

Respuesta correcta: 3. La existencia de daños cerebrales.